Clinical trial exclusion criterion:
Subjects with a history of drug or alcohol abuse within the past 6 months

Annotated entities:
- Temporal: "history of"
- Condition: "drug abuse"
- Condition: "alcohol abuse"
- Temporal: "within the past 6 months"
- Reference_point: "the past 6 months"